Clinical trial inclusion criterion:
Patients with a clinical diagnosis of depression who in the judgement of their physician require medication management may be eligible for enrollment. A score of 10 or more on the PHQ-9 instrument will be required for enrollment.

Entity relations:
- AND("depression", "medication")
- Has_value("PHQ-9", "score of 10 or more")
- AND("PHQ-9", "depression")